Clinical trial exclusion criterion:
Patient treated with corticosteroids within 2 weeks before study inclusion.

Entity relations:
- Has_index("within 2 weeks before study inclusion", "study inclusion")
- Has_temporal("corticosteroids", "within 2 weeks before study inclusion")